Clinical trial inclusion criterion:
Hospitalization with acute undifferentiated fever (temperature > 37.5 C, tympanic) =14 days or patients admitted to hospital with a history of fever = 14 days who subsequently develop fever within 24 hours of admission

Entity relations:
- Has_value("temperature", "> 37.5 C")
- AND("acute undifferentiated fever", "temperature")
- AND("Hospitalization", "acute undifferentiated fever")
- Has_multiplier("Hospitalization", "=14 days")
- Has_multiplier("fever", "= 14 days")
- Has_temporal("fever", "history")
- Has_temporal("fever", "within 24 hours of admission")
- Has_index("within 24 hours of admission", "admission")
- AND("admitted to hospital", "fever")
- AND("acute undifferentiated fever", "tympanic")
- AND("admitted to hospital", "fever")